=1 doses of ticagrelor or prasugrel within 5 days before randomisation

The above is a clinical trial inclusion criterion. Annotated with entity spans:
[Multiplier: =1 doses] of [Drug: ticagrelor] or [Drug: prasugrel] [Temporal: within 5 days before randomisation]